對於心室顫動（ventricular fibrillation）的病人，美國心臟醫學會指引（American Heart Association guidelines）提出所謂成人生命之鏈（adult chain of survival），下列敘述何者錯誤？
A. 早期啟動緊急醫療救護系統
B. 早期做心肺復甦術
C. 早期給藥
D. 早期做高級心臟救命術

正確答案：C. 早期給藥